For patients: Burn injury exceeding 6-8 Total Burned Surface Area %

The above is a clinical trial inclusion criterion. Annotated with entity spans:
For [Person: patients]: [Condition: Burn injury] [Value: exceeding 6-8] [Measurement: Total Burned Surface Area] %